Clinical trial exclusion criterion:
Urinary albumin/creatinine ratio higher than 3000 mg/g, at the baseline visit.

Annotated entities:
- Measurement: "Urinary albumin/creatinine ratio"
- Value: "higher than 3000 mg/g"
- Temporal: "at the baseline visit"